What is SMiLE-seq?

SMiLE-Seq is a novel, semiautomated protein-DNA interaction characterization technology, selective microfluidics-based ligand enrichment followed by sequencing for de novo transcription factor motif discovery.